Clinical trial inclusion criterion:
Age over 18 years

Entity relations:
- Has_value("Age", "over 18 years")